肩胛棘（scapular spine）的內側相當於下列何者的高度？
A. 第一胸椎
B. 第三胸椎
C. 第五胸椎
D. 第七胸椎

正確答案：B. 第三胸椎